Clinical trial exclusion criterion:
8. Have participated in the study before.

Annotated entities:
- Parsing_Error: "8."